Clinical trial exclusion criterion:
Have a 10 yr probability of hip fracture >3% or major fracture >20% based on results of the FRAX tool

Annotated entities:
- Measurement: "10 yr probability of hip fracture"
- Condition: "hip fracture"
- Value: ">3%"
- Measurement: "10 yr probability of major fracture"
- Condition: "major fracture"
- Undefined_semantics: "major fracture"
- Value: ">20%"